Clinical trial exclusion criterion:
Patients with severe cognitive impairment.

Entity relations:
- Has_qualifier("cognitive impairment", "severe")